Clinical trial exclusion criterion:
Emergent condition like hematemesis.

Entity relations:
- Subsumes("Emergent condition", "hematemesis")